Clinical trial exclusion criterion:
The participant has Modified Hoehn & Yahr stage 5 (or stage 5 at eather on-time or off-time for the participant with wearing off phenomenon).

Entity relations:
- Has_value("Modified Hoehn & Yahr", "stage 5")
- Has_value("wearing off phenomenon", "stage 5")
- Has_temporal("stage 5", "at on-time")
- OR("at on-time", "at off-time")
- OR("stage 5", "wearing off phenomenon")